Clinical trial inclusion criterion:
Subject has not been treated with any investigational drug or device within 30 days of the screening visit.

Annotated entities:
- Non-query-able: "Subject has not been treated with any investigational drug or device within 30 days of the screening visit."